Ante un paciente de 65 años sin antecedentes de interés que acude a la urgencia de un hospital, con fiebre de 39 ºC, síndrome meníngeo y signos de gravedad (coma, PA 80/60 mmHg, mal perfundido), ¿cuál de las siguientes actuaciones considera más correcta en este momento?
1. Extraer hemocultivos, perfundir suero salino y administrar tratamiento con dexametasona, ceftriaxona, vancomicina y ampicilina intravenosos y después hacer TAC craneal y punción lumbar si no hay contraindicación y reevaluar el tratamiento tras el TAC.
2. Hacer TAC con la urgencia que se pueda, fondo de ojo, posterior cultivo del LCR y tratamiento antibiótico dirigido según los datos del GRAM del LCR.
3. Poner antitérmico iv, iniciar tratamiento con dopamina iv a dosis alfa y cuando esté estable hemodinámicamente, hacer TAC craneal, punción lumbar e iniciar tratamiento antibiótico guiado según los datos analíticos del LCR.
4. Iniciar tratamiento con ceftazidima + aciclovir + vancomicina intravenosos.

Respuesta correcta: 1. Extraer hemocultivos, perfundir suero salino y administrar tratamiento con dexametasona, ceftriaxona, vancomicina y ampicilina intravenosos y después hacer TAC craneal y punción lumbar si no hay contraindicación y reevaluar el tratamiento tras el TAC.